有關腺病毒結膜炎（adenoviral keratoconjunctivitis）的敘述，下列何者錯誤？
A. 腺病毒可存活於乾燥表面，而導致結膜炎之流行
B. 可伴隨耳前淋巴結腫大（pre-auricular lymphadenopathy）
C. 局部點用類固醇眼藥水可縮短角膜炎之持續時間
D. 一般會兩眼發病

正確答案：C. 局部點用類固醇眼藥水可縮短角膜炎之持續時間